Clinical trial exclusion criterion:
Cognitive behavioural therapy or additional psychotherapy in past four months

Annotated entities:
- Procedure: "Cognitive behavioural therapy"
- Procedure: "psychotherapy"
- Qualifier: "additional"
- Temporal: "in past four months"